關於台灣之精神疾患的醫療照護，下列何者正確？
A. 罹患精神疾病雖然會造成功能減損，但整體而言，並不會比一般人口有更高的死亡率
B. 以標準化死亡比來看，台灣住院過之精神病患的該項數值遠低於工業化國家的數值
C. 台灣受儒家文化影響，重視敦親睦鄰，因此精神病患常可以得到良好的社區照顧
D. 台灣罹患嚴重精神疾病之患者從發病至住院之時間，遠較歐美病患為長

正確答案：D. 台灣罹患嚴重精神疾病之患者從發病至住院之時間，遠較歐美病患為長